Systemic treatment, within 14 days before the first dose of ixazomib, with strong cytochrome P450 3A (CYP3A) inducers (rifampin, rifapentine, rifabutin, carbamazepine, phenytoin, phenobarbital), or use of Ginkgo biloba or St. John's wort.

The above is a clinical trial exclusion criterion. Annotated with entity spans:
[Procedure: Systemic treatment], [Temporal: within 14 days before the first dose of ixazomib], with [Drug: strong cytochrome P450 3A (CYP3A) inducers] ([Drug: rifampin], [Drug: rifapentine], [Drug: rifabutin], [Drug: carbamazepine], [Drug: phenytoin], [Drug: phenobarbital]), or use of [Drug: Ginkgo biloba] or [Drug: St. John's wort].